Clinical trial exclusion criterion:
Use of any kind of medication under investigation within one year before the vaccination.

Annotated entities:
- Drug: "medication under investigation"
- Undefined_semantics: "medication under investigation"
- Temporal: "within one year before the vaccination"
- Reference_point: "the vaccination"